眼皮下垂（blepharoptosis）較不常見於下列何種疾病？
A. 甲狀腺眼病變（thyroid eye disease）
B. 霍納氏症候群（Horner's syndrome）
C. 重症肌無力（myasthenia gravis）
D. 第三對腦神經麻痺

正確答案：A. 甲狀腺眼病變（thyroid eye disease）